Clinical trial exclusion criterion:
Known coagulopathy

Annotated entities:
- Condition: "coagulopathy"